Patients with surgical contraindication or reject to surgery.

The above is a clinical trial inclusion criterion. Annotated with entity spans:
Patients with [Procedure: surgical] [Condition: contraindication] or [Observation: reject] to [Procedure: surgery].